What are the five traits associated with metabolic syndrome?

Metabolic syndrome is the concurrent presentation of multiple cardiovascular risk factors. These factors include obesity, insulin resistance, hyperglycemia, dyslipidemia and hypertension.